La ventilación alveolar es el volumen de aire que:
1. Entra (o sale) de los pulmones en cada respiración.
2. Entra (o sale) en las vías respiratorias cada minuto.
3. Queda en los alveolos tras una espiración normal.
4. Entra (o sale) en las zonas de intercambio pulmonar en un minuto
5. Queda en los alveolos tras una espiración forzada.

Respuesta correcta: 4. Entra (o sale) en las zonas de intercambio pulmonar en un minuto